Clinical trial inclusion criterion:
Healthy volunteer without significant medical problems

Annotated entities:
- Person: "volunteer"
- Qualifier: "Healthy"